Clinical trial exclusion criterion:
Diabetes Type I and II

Annotated entities:
- Condition: "Diabetes Type I"
- Condition: "Diabetes Type II"